Clinical trial exclusion criteria:
Renal impairment
Evidence or history of clinically significant allergic reactions to varenicline
A cardiovascular event in the past month
History of alcohol or drug dependence in the past year
Major depressive disorder in the last year requiring treatment
History of panic disorder, psychosis, bipolar disorder, or eating disorders
Use of tobacco products other than cigarettes in past 30 days
Use of pharmacotherapy in the month prior to enrollment, including prior use of varenicline
Pregnant, contemplating getting pregnant, or breastfeeding
Plans to move from Kansas City during the treatment and follow-up phase
Another household member enrolled in the study
Evidence of current severe major depressive disorder or suicidal ideation

Annotated entities:
- Condition: "Renal impairment"
- Condition: "allergic"
- Drug: "varenicline"
- Condition: "cardiovascular event"
- Temporal: "in the past month"
- Condition: "drug dependence"
- Condition: "alcohol dependence"
- Temporal: "the past year"
- Condition: "Major depressive disorder"
- Temporal: "last year"
- Procedure: "treatment"
- Condition: "panic disorder"
- Condition: "psychosis"
- Condition: "bipolar disorder"
- Condition: "eating disorders"
- Observation: "Use of tobacco"
- Negation: "other than"
- Observation: "cigarettes"
- Temporal: "past 30 days"
- Procedure: "pharmacotherapy"
- Temporal: "month prior to enrollment"
- Reference_point: "enrollment"
- Pregnancy_considerations: "Pregnant, contemplating getting pregnant, or breastfeeding"
- Non-query-able: "Plans to move from Kansas City during the treatment and follow-up phase"
- Non-query-able: "Another household member enrolled in the study"
- Condition: "major depressive disorder"
- Qualifier: "severe"
- Condition: "suicidal ideation"